Clinical trial exclusion criterion:
ALP >= 3 x ULN

Annotated entities:
- Measurement: "ALP"
- Value: ">= 3 x ULN"